Clinical trial exclusion criterion:
Judged unable to comply with the training protocol.

Annotated entities:
- Post-eligibility: "Judged unable to comply with the training protocol."